Clinical trial exclusion criterion:
Treprostinil contraindications: Known hypersensitivity to treprostinil or any of the excipients, Pulmonary arterial hypertension related to veno-occlusive disease, Congestive heart failure due to severe left ventricular dysfunction, Severe hepatic insufficiency (Child-Pugh stage C), Evolving gastrointestinal ulcer, intracranial hemorrhage, recent trauma or other clinical condition that may lead to bleeding, Congenital or acquired valvular abnormalities with cardiac repercussions, Severe ischemic heart disease or unstable angina; Myocardial infarction in the last six months; Decompensated cardiac insufficiency not medically controlled; Severe arrhythmias; Cerebrovascular lesions (such as transient ischemic attack, stroke) that occurred within the last three months.

Annotated entities:
- Condition: "contraindications"
- Drug: "Treprostinil"
- Condition: "hypersensitivity"
- Drug: "treprostinil"
- Drug: "any of the excipients"
- Condition: "Pulmonary arterial hypertension"
- Condition: "veno-occlusive disease"
- Condition: "Congestive heart failure"
- Condition: "left ventricular dysfunction"
- Condition: "hepatic insufficiency"
- Qualifier: "severe"
- Qualifier: "Severe"
- Measurement: "Child-Pugh"
- Value: "stage C"
- Condition: "gastrointestinal ulcer"
- Qualifier: "Evolving"
- Condition: "intracranial hemorrhage"
- Condition: "trauma"
- Temporal: "recent"
- Condition: "clinical condition that may lead to bleeding"
- Undefined_semantics: "clinical condition that may lead to bleeding"
- Condition: "Congenital valvular abnormalities"
- Condition: "acquired valvular abnormalities"
- Qualifier: "with cardiac repercussions"
- Condition: "ischemic heart disease"
- Qualifier: "Severe"
- Condition: "unstable angina"
- Condition: "Myocardial infarction"
- Temporal: "in the last six months"
- Condition: "Decompensated cardiac insufficiency"
- Qualifier: "not medically controlled"
- Condition: "arrhythmias"
- Qualifier: "Severe"
- Condition: "Cerebrovascular lesions"
- Condition: "transient ischemic attack"
- Condition: "stroke"
- Temporal: "within the last three months"